Clinical trial exclusion criterion:
Patients with current diagnosis of primary cutaneous ALCL (patients whose ALCL has transformed to sALCL are eligible).

Entity relations:
- OR("primary cutaneous ALCL", "sALCL")